Cervical length <=25mm between 18(0) and 23(6) weeks

The above is a clinical trial inclusion criterion. Annotated with entity spans:
[Measurement: Cervical length] [Value: <=25mm] [Qualifier: between 18(0) and 23(6) weeks]